Clinical trial inclusion criterion:
Written informed consent obtained prior to enrolling in roll-over study

Annotated entities:
- Observation: "Written informed consent"
- Temporal: "prior to enrolling in roll-over study"
- Reference_point: "enrolling in roll-over study"